Clinical trial exclusion criterion:
Age > 18 Years

Entity relations:
- Has_value("Age", "> 18 Years")